Clinical trial exclusion criterion:
Serious hematologic disease (e.g. CML, MDS)

Entity relations:
- Has_qualifier("hematologic disease", "Serious")
- Subsumes("hematologic disease", "CML")
- OR("CML", "MDS")